Elevated fasting glucose (=100 mg/dl), or on medication for treating the condition

The above is a clinical trial inclusion criterion. Annotated with entity spans:
[Condition: Elevated fasting glucose] ([Value: =100 mg/dl]), or on [Drug: medication for treating] the condition